在醫療院所內執行病人衛生教育時，其對象以下列那一種安排最理想？
A. 病人本身
B. 病人的子女
C. 病人的配偶
D. 病人及主要照顧者

正確答案：D. 病人及主要照顧者